某病患之臨床表現包括動作遲緩（bradykinesia）、小碎步、靜止性震顫（resting tremor）等，其最常見是中樞神經系統中何處發生退化性病變？
A. 黑質（substantia nigra）
B. 白質（white matter）
C. 尾狀核（caudate nucleus）
D. 紅核（red nucleus）

正確答案：A. 黑質（substantia nigra）